Clinical trial exclusion criterion:
Active psychosis or psychotic disorder, severe depression (as determined per clinician prescriber judgment), severe psychiatric instability or severe situational life crisis (including evidence of being actively suicidal or homicidal).

Annotated entities:
- Condition: "psychotic disorder"
- Condition: "psychosis"
- Qualifier: "Active"
- Condition: "severe depression"
- Condition: "psychiatric instability"
- Qualifier: "severe"
- Condition: "situational life crisis"
- Qualifier: "severe"
- Condition: "suicidal"
- Condition: "homicidal"